下列那種藥物，臨床上通常並不需要定期抽血監測該種藥物之血中濃度？
A. clozapine
B. lithium
C. valproic acid
D. carbamazepine

正確答案：A. clozapine